下列何者是實驗室中用來將質體（plasmid）直接轉形（transformation）進入細菌的最常用的方法？
A. 低電壓電泳法（low-voltage electrophoresis）將質體牽引入細菌中
B. 帶有質體的噬菌體轉染法（transfection）
C. 微注射法（micro-injection）將質體注入細菌中
D. CaCl2處理細菌後再以熱休克法（heat shock）將質體送入細菌中

正確答案：D. CaCl2處理細菌後再以熱休克法（heat shock）將質體送入細菌中